Clinical trial inclusion criterion:
Accepting to participate in the study

Annotated entities:
- Post-eligibility: "ccepting to participate in the study"